Clinical trial exclusion criterion:
Ongoing treatment with inotropic drugs (not norepinephrine)

Annotated entities:
- Temporal: "Ongoing"
- Procedure: "treatment"
- Drug: "inotropic drugs"
- Drug: "norepinephrine"
- Negation: "not"